Clinical trial inclusion criterion:
Stool examination for enteric pathogens including Clostridium difficile

Entity relations:
- Has_qualifier("Stool examination", "for enteric pathogens including Clostridium difficile")